Which human chromosome is the product of fusion?

Origin of human chromosome 2: an ancestral telomere-telomere fusion.